NO tiene un origen nervioso:
1. Células ependimarias.
2. Microglía.
3. Astrocitos.
4. Células quimiosensibles bulbares.

Respuesta correcta: 2. Microglía.